統計假說檢定（statistical hypothesis testing）時，何謂型一錯誤（type I error）？
A. 兩組實際上無差異，分析結果推翻虛無假說（null hypothesis）
B. 兩組實際上無差異，分析結果支持虛無假說（null hypothesis）
C. 兩組實際上有差異，分析結果推翻虛無假說（null hypothesis）
D. 兩組實際上有差異，分析結果支持虛無假說（null hypothesis）

正確答案：A. 兩組實際上無差異，分析結果推翻虛無假說（null hypothesis）